What is the most advanced phase of clinical trial that fingolimod has entered?

Fingolimod has been assessed in phase IV clinical trials.